Clinical trial exclusion criterion:
abnormal liver function tests (AST/ALT > 43 U/L), liver disease, viral hepatitis, hepatitis B virus (HBV) infection

Annotated entities:
- Measurement: "liver function tests"
- Value: "abnormal"
- Measurement: "AST"
- Measurement: "ALT"
- Value: "> 43 U/L"
- Condition: "liver disease"
- Condition: "viral hepatitis"
- Condition: "hepatitis B virus (HBV) infection"